Hypersensitivity to perflutren, blood, blood products or albumin

The above is a clinical trial exclusion criterion. Annotated with entity spans:
[Condition: Hypersensitivity] to [Drug: perflutren], [Procedure: blood], [Procedure: blood products] or [Drug: albumin]